Which syndrome is caused by dysfunction of the ciliary ARMC9/TOGARAM1 protein?

Joubert syndrome (JBTS) is a rare autosomal recessive disorder caused by dysfunction of the ciliary ARMC9/TOGARAM1 protein.